Major depressive disorder with psychotic features

The above is a clinical trial exclusion criterion. Annotated with entity spans:
[Condition: Major depressive disorder] with psychotic features